Sensation of anorectal obstruction/blockage for =25% of defecations

The above is a clinical trial inclusion criterion. Annotated with entity spans:
[Condition: Sensation of anorectal obstruction]/blockage for [Multiplier: =25%] of [Condition: defecations]